Negative urine or serum pregnancy test (for women of childbearing potential) documented within the 24-hour period prior to the first dose of test drug. Additionally, all females must be using reliable contraception during the study and for 3 months after treatment completion

The above is a clinical trial inclusion criterion. Annotated with entity spans:
[Value: Negative] [Measurement: urine] or [Measurement: serum pregnancy test] (for [Person: women] of [Condition: childbearing potential]) documented [Temporal: within the 24-hour period prior to the first dose of test drug]. [Pregnancy_considerations: Additionally, all females must be using reliable contraception during the study and for 3 months after treatment completion]